¿Cómo afecta el incremento de temperatura a la reacción entre antígeno y anticuerpo?
1. Aumenta la velocidad de reacción y disminuye la afinidad de unión.
2. Disminuye la velocidad de reacción y aumenta la afinidad de unión.
3. Aumenta la velocidad de reacción y la afinidad de unión.
4. Disminuye la velocidad de reacción y la afinidad de unión.
5. Ninguna de las opciones anteriores es correcta.

Respuesta correcta: 1. Aumenta la velocidad de reacción y disminuye la afinidad de unión.